Lower respiratory tract infection within the 4 weeks prior to Visit 1 .

The above is a clinical trial exclusion criterion. Annotated with entity spans:
[Condition: Lower respiratory tract infection] [Temporal: within the 4 weeks prior to Visit 1] .